Clinical trial exclusion criterion:
Acute clinically significant pulmonary, cardiovascular, hepatic or renal functional abnormality, as determined by physical examination or laboratory screening tests.

Annotated entities:
- Condition: "cardiovascular functional abnormality"
- Condition: "hepatic functional abnormality"
- Condition: "renal functional abnormality"
- Condition: "pulmonary functional abnormality"